8. Informed assent obtained and signed

The above is a clinical trial inclusion criterion. Annotated with entity spans:
8. [Post-eligibility: Informed assent obtained and signed]